Clinical trial exclusion criterion:
Neoadjuvant therapy for current breast cancer diagnosis

Annotated entities:
- Procedure: "Neoadjuvant therapy"
- Condition: "breast cancer"